ASA I

The above is a clinical trial inclusion criterion. Annotated with entity spans:
[Measurement: ASA] [Value: I]